Male or Female

The above is a clinical trial inclusion criterion. Annotated with entity spans:
[Person: Male] or [Person: Female]